Clinical trial exclusion criterion:
Investigational drugs/agents within 14 days of first dose of 852A

Annotated entities:
- Drug: "Investigational drugs/agents"
- Temporal: "within 14 days of first dose"
- Drug: "852A"